Clinical trial exclusion criterion:
Severe distal arteriopathie > stage II of Leriche and Fontaine

Annotated entities:
- Qualifier: "Severe"
- Condition: "distal arteriopathie"
- Measurement: "stage of Leriche and Fontaine"
- Value: "> II"